Which is the target of belimumab in Systemic Lupus Erythematosus treatment?

Belimumab, a fully human monoclonal antibody against B lymphocyte stimulator (BLyS), a B-cell survival factor, was licensed in 2011 for the treatment of autoantibody-positive SLE